一位 55 歲男性，主訴因手抖的厲害，在外院已看了將近 10 年，也吃了好幾種藥，初期非常有效，但最近控制不好。神經學檢查發現他的雙側肢體在休息時有很明顯的顫抖，且動作僵硬，向後拉之測試（pull-test）若不擋住可能會跌倒。該病患最有可能的診斷是：
A. 巴金森氏症第 2 期
B. 巴金森氏症第 3 期
C. 原發性顫抖
D. 小腦萎縮症

正確答案：B. 巴金森氏症第 3 期